Capacity to provide informed consent before any trial-related activities

The above is a clinical trial inclusion criterion. Annotated with entity spans:
[Informed_consent: Capacity to provide informed consent before any trial-related activities]